Clinical trial exclusion criterion:
Women of childbearing age without reliable contraception

Annotated entities:
- Person: "Women"
- Person: "childbearing age"
- Qualifier: "reliable"
- Procedure: "contraception"
- Negation: "without"